Clinical trial exclusion criteria:
Diabetes mellitus type 1
renal insufficiency III-V °
Cirrhosis hepatis (Child B or higher)
Chronic alcohol abuse
rheumatic disease (RA, SpA, SLE)
Malignancies (<5 years)
Eating Disorder (anorexia nervosa, bulimia)
bone-specific pretreatment (DMAB, TPTD, strontium ranelate, SERMs) Bisphosphonate treatment is allowed

Annotated entities:
- Condition: "Diabetes mellitus type 1"
- Condition: "renal insufficiency"
- Qualifier: "III-V °"
- Condition: "Cirrhosis hepatis"
- Measurement: "Child"
- Value: "B or higher"
- Qualifier: "Child B or higher"
- Multiplier: "Chronic"
- Condition: "alcohol abuse"
- Condition: "rheumatic disease"
- Condition: "RA"
- Condition: "SpA"
- Condition: "SLE"
- Condition: "Malignancies"
- Temporal: "<5 years"
- Condition: "Eating Disorder"
- Condition: "anorexia nervosa"
- Condition: "bulimia"
- Procedure: "bone-specific pretreatment"
- Drug: "DMAB"
- Drug: "TPTD"
- Drug: "SERMs"
- Drug: "strontium ranelate"
- Non-representable: "Bisphosphonate treatment is allowed"